Clinical trial exclusion criterion:
The other types of pulmonary hypertension.

Entity relations:
- Has_qualifier("pulmonary hypertension", "other types")